Clinical trial exclusion criterion:
3. local steroid injection within 6 weeks or physical therapy within 4 weeks

Entity relations:
- Has_temporal("physical therapy", "within 4 weeks")
- Has_temporal("local steroid injection", "within 6 weeks")
- OR("local steroid injection", "physical therapy")